Clinical trial exclusion criterion:
Multiple pregnancy (more than 3 fetuses)

Annotated entities:
- Condition: "Multiple pregnancy"
- Value: "more than 3"
- Measurement: "fetuses"